How are deletion breakpoints defined?

Commonly used methods for the detection of CNV breakpoints include long-range PCR and primer walking, their success being limited by the deletion size, GC content and presence of DNA repeats. A promising new workflow relies on real-time quantitative PCR to narrow down the deletion region and Sanger sequencing for breakpoint confirmation.